以下何種檢查最能區辨活動量較少之譫妄及嚴重憂鬱之患者？
A. 抽血檢查電解質
B. 腦部電腦斷層檢查
C. 腦波檢查
D. 檢查動脈之血氧濃度

正確答案：C. 腦波檢查